Clinical trial exclusion criterion:
Concurrent participation in another clinical trial

Annotated entities:
- Observation: "participation in another clinical trial"